Left ventricular ejection fraction (LVEF) = 45%

The above is a clinical trial inclusion criterion. Annotated with entity spans:
[Measurement: Left ventricular ejection fraction (LVEF)] [Value: = 45%]